Which is the neurodevelopmental disorder associated to mutations in the X- linked gene mecp2?

The neurodevelopmental disorder named Rett syndrome, originally termed as cerebroatrophic hyperammonemia. Although most exclusively affects females, has also been found in male patients.